Patients with clinical signs of raised ICP.

The above is a clinical trial exclusion criterion. Annotated with entity spans:
Patients with clinical signs of [Value: raised] [Measurement: ICP].